Clinical trial inclusion criterion:
Positive for at least one of the anti-islet autoantibodies: GADA, IA2A, ZnT8A

Annotated entities:
- Multiplier: "at least one"
- Condition: "anti-islet autoantibodies"
- Condition: "GADA"
- Condition: "IA2A"
- Condition: "ZnT8A"